Describe Full Spectrum of Intolerance to Loss-of-function (FUSIL)

Full Spectrum of Intolerance to Loss-of-function (FUSIL) is a cross-species gene classification across the full spectrum of genes in five mutually exclusive categories have differing biological properties. FUSIL is proposed as an efficient approach for disease gene discovery.